Clinical trial inclusion criterion:
PICU admission

Annotated entities:
- Visit: "PICU"
- Procedure: "admission"